Clinical trial inclusion criterion:
First Diagnosed Head and neck cancer and plan for treatment with cisplatin

Annotated entities:
- Condition: "Head and neck cancer"
- Mood: "plan"
- Drug: "cisplatin"